Clinical trial inclusion criterion:
11. Serum potassium, magnesium, and calcium levels should be at least within institutional normal limits.

Annotated entities:
- Measurement: "Serum potassium"
- Measurement: "Serum magnesium"
- Measurement: "Serum calcium"
- Value: "at least within institutional normal limits"